Uno de los siguientes efectos es característico del consumo de morfina:
1. Midriasis.
2. Ojo enrojecido.
3. Lagrimeo excesivo.
4. Miosis.
5. Aumento de la presión intraocular.

Respuesta correcta: 4. Miosis.